Desde la perspectiva cognitivo comportamental, para el tratamiento del trastorno esquizotípico de la personalidad se recomienda:
1. La terapia de exposición.
2. Las técnicas operantes.
3. La terapia interpersonal.
4. El entrenamiento en mindfulness.
5. El entrenamiento en habilidades sociales.

Respuesta correcta: 5. El entrenamiento en habilidades sociales.